針對糖尿病患者，若積極控制血糖，則下列敘述何者錯誤？
A. 糖尿病視網膜病變（diabetic retinopathy, DR）就一定不會發生
B. 可減緩背基型糖尿病視網膜病變（background diabetic retinopathy, BDR）之惡化
C. 可降低增殖型糖尿病視網膜病變（proliferative diabetic retinopathy, PDR）之形成
D. 可減少視網膜雷射治療（laser photocoagulation）之需求

正確答案：A. 糖尿病視網膜病變（diabetic retinopathy, DR）就一定不會發生